All prevalent patients (diagnosed >12 month ago) with PAH or distal CTEPH who had a consultation at the PH centre in Zurich between November 2015 and November 2016)

The above is a clinical trial inclusion criterion. Annotated with entity spans:
All [Context_Error: prevalent] patients (diagnosed [Temporal: >12 month ago]) with [Condition: PAH] or [Qualifier: distal] [Condition: CTEPH] who had a [Non-query-able: consultation at the PH centre] in [Visit: Zurich] [Temporal: between November 2015 and November 2016])